50 歲男性，因半夜突然劇烈撕裂性背痛於兩肩胛骨間，來到急診，理學檢查發現脈搏每分鐘 68 下，兩手血壓正常，無心雜音，腹部柔軟，心電圖無特殊變化，胸部 X 光顯示縱隔腔變寬，兩側無肋膜積液。住院後，忽然胸痛加劇，左手血壓量不到，以下的敘述何者可能性最低？
A. 病患可能為主動脈剝離延伸左鎖骨下動脈
B. 若病程進展，病患可能接著發生左半身癱瘓
C. 若病程進展，病患可能接著發生下半身癱瘓
D. 若病程進展，病患可能接著發生急性腹痛

正確答案：B. 若病程進展，病患可能接著發生左半身癱瘓